History of snake bite with features of local envenomation with/without systemic features

The above is a clinical trial inclusion criterion. Annotated with entity spans:
History of [Condition: snake bite] with [Mood: features of] [Condition: local envenomation] with/without [Condition: systemic features]